Clinical trial exclusion criterion:
Any intraocular inflammation in the study eye present during the screening slit lamp examination

Annotated entities:
- Value: "intraocular inflammation"
- Temporal: "during the screening slit lamp examination"
- Reference_point: "the screening slit lamp examination"
- Procedure: "slit lamp examination"
- Condition: "intraocular inflammation"